Clinical trial inclusion criterion:
GIS score of at least 6.

Entity relations:
- Has_value("GIS score", "at least 6")